1. Have a finding of a mass lesion on mammography or breast MRI (BIRADS 0, 4 or 5) that is >0.5 cm and < 2 cm in size and has had or will have additional workup with focused ultrasound.

The above is a clinical trial inclusion criterion. Annotated with entity spans:
1. Have a finding of a [Condition: mass lesion] on [Procedure: mammography] or [Procedure: breast MRI] ([Measurement: BIRADS] [Value: 0, 4 or 5]) that is [Value: >0.5 cm and < 2 cm] in [Measurement: size] and [Non-query-able: has had or will have additional workup with focused ultrasound].